La inteligencia fluida:
1. Está implicada en tareas que son nuevas.
2. Se muestra en tareas con contenido verbal.
3. Refleja el aprendizaje formal.
4. No forma parte de la inteligencia general.
5. Delimita destrezas basadas en la experiencia previa.

Respuesta correcta: 1. Está implicada en tareas que son nuevas.